有關骨骼巨大細胞瘤（giant cell tumor of bone）的敘述，下列何者正確？
A. 最常好發於10歲以下幼童的長骨骨幹，很少侵犯到骨骺（epiphysis）
B. 最常見的X光發現是一個成骨性（osteoblastic）之破壞性病灶，且常有明顯的骨膜反應（periosteal reaction）
C. 最常用的治療方式是廣泛切除（wide excision）手術
D. 為避免局部復發（local recurrence），往往手術中需合併輔助器材，如高速磨鑽（high-speed burr）清除腫瘤或滑水泥填充等

正確答案：D. 為避免局部復發（local recurrence），往往手術中需合併輔助器材，如高速磨鑽（high-speed burr）清除腫瘤或滑水泥填充等